下列有關治療巴金森氏症的藥物 levodopa 的描述，何者正確？
A. levodopa 口服效果差，需以靜脈注射的方式投藥
B. levodopa 通常不可以與 selegiline（deprenyl）併用
C. levodopa 經常與 bromocriptine 併用，以延長其作用的時間
D. levodopa 會導致食慾下降

正確答案：D. levodopa 會導致食慾下降